Clinical trial inclusion criterion:
Previous chemotherapy or radiotherapy must have been performed ≥ 8 weeks prior to study entry.

Annotated entities:
- Procedure: "chemotherapy"
- Procedure: "radiotherapy"
- Temporal: "Previous"
- Temporal: "≥ 8 weeks prior to study entry"